Clinical trial exclusion criterion:
Hospitalization for acute decompensated HF within previous 30 days

Entity relations:
- AND("Hospitalization", "acute decompensated HF")
- Has_temporal("Hospitalization", "within previous 30 days")